Clinical trial exclusion criterion:
Refusal for organ procurement by the donor (confirmed by the French national register or reported by the next-of-kin).

Entity relations:
- AND("Refusal by the donor", "organ procurement")
- Has_qualifier("Refusal by the donor", "French national register")
- OR("French national register", "reported by the next-of-kin")